Clinical trial inclusion criterion:
Neurological disease

Annotated entities:
- Condition: "Neurological disease"